¿Qué par de aminoácidos modificados es muy frecuente en el colágeno?
1. 4-Hidroxi-prolina y 5-Hidroxi-lisina.
2. Histamina y 5-Metil-lisina.
3. Carboxiglutamato y 4-Hidroxi-prolina.
4. S-Adenosil-metionina y 5-Metil-prolina.
5. Metil-Fenilalanina e Histamina.

Respuesta correcta: 1. 4-Hidroxi-prolina y 5-Hidroxi-lisina.